下列有關尺神經（Ulnar nerve）被壓迫之敘述，何者為非？
A. 最常見的位置在手肘
B. 在手肘處的尺神經壓迫必須和內側肱上髁炎（medial epicondylitis）區分
C. 在手肘的尺神經壓迫皆不須開刀治療
D. 尺神經在手肘部位受壓迫的幾種開刀方式中，並沒有那一種方式較好

正確答案：C. 在手肘的尺神經壓迫皆不須開刀治療